Clinical trial exclusion criterion:
History of drug or alcohol abuse within recent 1 year

Entity relations:
- Has_temporal("drug abuse", "within recent 1 year")
- Has_temporal("drug abuse", "History")
- OR("drug abuse", "alcohol abuse")